Tiene una herencia autosómica dominante la:
1. Alcaptonuria.
2. Corea de Huntington.
3. Síndrome de Rett.
4. Daltonismo.
5. Distrofia muscular de Duchenne.

Respuesta correcta: 2. Corea de Huntington.